Clinical trial inclusion criterion:
AB0 compatible transplant.

Annotated entities:
- Qualifier: "AB0 compatible"
- Procedure: "transplant"